Clinical trial exclusion criterion:
Patient who have active bleeding disorder, such as intracranial hemorrhage, upper gastrointestinal bleeding, hematuria.

Entity relations:
- Has_qualifier("bleeding disorder", "active")
- Subsumes("bleeding disorder", "intracranial hemorrhage")
- OR("intracranial hemorrhage", "hematuria", "upper gastrointestinal bleeding")